A family history of congenital or hereditary immunodeficiency.

The above is a clinical trial exclusion criterion. Annotated with entity spans:
A [Observation: family history] of [Condition: congenital] or [Condition: hereditary immunodeficiency].